Clinical trial exclusion criterion:
Inability to follow directions or comprehend the English language

Entity relations:
- OR("Inability to follow directions", "Inability to comprehend the English language")